Clinical trial inclusion criterion:
Men and women aged 18-45 years.

Entity relations:
- Has_value("aged", "18-45 years")
- OR("Men", "women")